past esophageal, gastric or bariatric surgery

The above is a clinical trial exclusion criterion. Annotated with entity spans:
past [Procedure: esophageal], [Procedure: gastric] or [Procedure: bariatric surgery]